下列關於 21-羥缺乏（21-hydroxylase deficiency）所引致之先天性腎上腺增生（congenital adrenal hyperplasia）患童之敘述，何者錯誤？
A. 體染色體隱性遺傳（autosomal recessive）
B. 於女患童會引致性器混淆（ambiguous genitalia）
C. 單純雄性化型（simple virilizing form）占 75%
D. 患者血清中 17-羥助孕酮（17-hydroxyprogesterone）值高於正常值

正確答案：C. 單純雄性化型（simple virilizing form）占 75%